Presenta células centroacinosas la glándula:
1. Parótida.
2. Submaxilar.
3. Sublingual.
4. Páncreas.
5. Hígado.

Respuesta correcta: 4. Páncreas.